Señale la medida de prevención secundaria que se ha demostrado efectiva en el cáncer de colón:
1. Facilitar la realización de test de sangre oculta en heces con periodicidad anual o bienal y/o sigmoidoscopia o colonoscopia cada 5 años en personas con riesgo elevado.
2. Fomentar el consumo de leche y otros productos lácteos, pescado y frutas.
3. Evitar el consumo de carne cocinada muy hecha o en contacto directo con el fuego.
4. Evitar el consumo de tabaco y la ingesta de alcohol.
5. Todas las respuestas anteriores son correctas.

Respuesta correcta: 1. Facilitar la realización de test de sangre oculta en heces con periodicidad anual o bienal y/o sigmoidoscopia o colonoscopia cada 5 años en personas con riesgo elevado.